Clinical trial exclusion criterion:
any intraocular surgery within the previous 12 months.

Entity relations:
- Has_temporal("intraocular surgery", "within the previous 12 months")